Clinical trial inclusion criterion:
No acute diverticulitis episode in the last 3 months

Annotated entities:
- Condition: "diverticulitis"
- Qualifier: "acute"
- Temporal: "in the last 3 months"